下列何種病原菌尚無法培養？
A. 肺炎黴漿菌（Mycoplasma pneumoniae）
B. 梅毒螺旋菌（Treponema pallidum）
C. 淋病雙球菌（Neisseria gonorrhoeae）
D. 腸炎弧菌（Vibrio parahaemolyticus）

正確答案：B. 梅毒螺旋菌（Treponema pallidum）